Clinical trial inclusion criterion:
preserved left ventricular ejection fraction (>= 50%) on echocardiography

Annotated entities:
- Measurement: "left ventricular ejection fraction"
- Value: "preserved"
- Value: ">= 50%"
- Procedure: "echocardiography"